Clinical trial exclusion criterion:
5. Untreated urogenital infections (either symptomatic or asymptomatic) within 2 weeks prior to enrollment

Entity relations:
- Has_qualifier("urogenital infections", "Untreated")
- AND("urogenital infections", "symptomatic")
- Has_index("within 2 weeks prior to enrollment", "enrollment")
- Has_temporal("urogenital infections", "within 2 weeks prior to enrollment")
- OR("symptomatic", "asymptomatic")